What are the 3 antidotes for anticoagulant (anti-blood clotting) drugs, including factor Xa inhibitors, as of November 2017.

two potential reversal agents for oral direct factor Xa inhibitors (andexanet alfa and ciraparantag) are at various stages of clinical development. Idarucizumab, a reversal agent for the oral direct thrombin inhibitor dabigatran, was approved by FDA in October 2015.